在腸疾病中，有表現跳躍式病變（skip lesion）者為何？
A. Zenker 氏憩室
B. Meckel 氏憩室
C. Crohn 氏病
D. Hirschsprung 氏病

正確答案：C. Crohn 氏病